patients without health insurance,

The above is a clinical trial exclusion criterion. Annotated with entity spans:
patients [Negation: without] [Person: health insurance],